The ulcer have been treated with growth factors in the last 8 weeks

The above is a clinical trial exclusion criterion. Annotated with entity spans:
The [Condition: ulcer] have been [Procedure: treated] with [Drug: growth factors] [Temporal: in the last 8 weeks]